Clinical trial exclusion criterion:
Clinically significant (> 4 Tablespoons per day) sputum production

Annotated entities:
- Qualifier: "Clinically significant"
- Multiplier: "> 4 Tablespoons per day"
- Observation: "sputum production"